Clinical trial inclusion criterion:
Men or women aged 18 years or older

Entity relations:
- Has_value("aged", "18 years or older")